La reacción en la que un haluro de vinilo o arilo reacciona con un alquino terminal en presencia de ioduro cuproso y un catalizador de Pd (0) se conoce como reacción de:
1. Suzuki.
2. Heck.
3. Stille.
4. Sonogashira.
5. Sharpless.

Respuesta correcta: 4. Sonogashira.